下列何項因素和術後腹部傷口裂開較無關係？
A. 腹內感染
B. 營養不良
C. 高血壓
D. 長期使用類固醇

正確答案：C. 高血壓